Clinical trial exclusion criterion:
Any clinically significant abnormality or medical history or physical examination including history of immunodeficiency or autoimmune disease (in addition to HCV infection, for HCV group)

Annotated entities:
- Condition: "immunodeficiency"
- Condition: "autoimmune disease"
- Negation: "in addition to"
- Condition: "HCV infection"